Clinical trial inclusion criterion:
= 18 years

Annotated entities:
- Person: "= 18 years"
- Value: "= 18 years"